Clinical trial inclusion criterion:
10. Women of child-bearing potential must have a negative pregnancy test

Entity relations:
- AND("child-bearing potential", "pregnancy test")
- Has_value("pregnancy test", "negative")
- AND("Women", "pregnancy test")